Clinical trial inclusion criterion:
written informed consent (approved by the Institutional Review Board [IRB]/Independent Ethics Committee [IEC]) obtained prior to any study specific procedures.

Annotated entities:
- Non-query-able: "written informed consent"